聽覺毛細胞（auditory hair cells）去極化時， 初始的離子流動現象為何？
A. influx of K+
B. outflux of K+
C. influx of Na+
D. outflux of Ca2+

正確答案：A. influx of K+